List SLC25A46-related pathologies

SLC25A46-related pathologies include optic atrophy, Charcot-Marie-Tooth type 2, Leigh syndrome, progressive myoclonic ataxia and lethal congenital ptacerebellar hypoplasia.